Clinical trial inclusion criterion:
18 years or older

Annotated entities:
- Person: "years"
- Value: "18 or older"